Clinical trial exclusion criteria:
<37 weeks gestation, H/o Cesarean Section, Multiple Gestation, Pre-eclampsia, Narcotics within 3 hours prior to labor epidural placement, Chronic Pain (as defined by chronic opiate consumption), Women who are participating in another study that will impact protocol

Annotated entities:
- Measurement: "gestation"
- Value: "<37 weeks"
- Procedure: "Cesarean Section"
- Condition: "Multiple Gestation"
- Observation: "H/o"
- Condition: "Pre-eclampsia"
- Drug: "Narcotics"
- Temporal: "within 3 hours prior to labor epidural placement"
- Procedure: "labor epidural placement"
- Reference_point: "labor epidural placement"
- Condition: "Chronic Pain"
- Multiplier: "chronic"
- Drug: "opiate"
- Competing_trial: "Women who are participating in another study that will impact protocol"